Clinical trial exclusion criterion:
Patients with surgical or medical intestinal diseases or having received surgeries that could interfere with drug absorption distribution, metabolism and elimination

Entity relations:
- Has_qualifier("intestinal diseases", "surgical")
- Has_qualifier("intestinal diseases", "could interfere with drug absorption distribution")
- OR("surgical", "medical")
- OR("could interfere with drug absorption distribution", "could interfere with drug elimination", "could interfere with drug metabolism")
- OR("intestinal diseases", "surgeries")